精液（semen）不含下列何者之分泌產物？
A. 前列腺（prostate gland）
B. 陰莖海綿體（corpus cavernosum）
C. 尿道球腺（bulbourethral gland）
D. 精囊（seminal vesicle）

正確答案：B. 陰莖海綿體（corpus cavernosum）